Clinical trial exclusion criterion:
kidney failure (creatinin > 2 g/dl, creatinin <clearance 30 ml/h) and/or hepatic failure (cholinesterase < 2000 UI);

Annotated entities:
- Condition: "kidney failure"
- Measurement: "creatinin"
- Measurement: "creatinin <clearance"
- Value: "30 ml/h"
- Value: "> 2 g/dl"
- Condition: "hepatic failure"
- Measurement: "cholinesterase"
- Value: "< 2000 UI"